Clinical trial inclusion criterion:
Provide written informed consent.

Annotated entities:
- Post-eligibility: "Provide written informed consent"